52 歲男性病人於 12 月 8 日夜晚 11 時突然胸痛發作、輕度呼吸困難。至翌日下午 2 時才至急診室求診。理學檢查發現急病狀，血壓 140/70 mmHg、心跳 88 /min、無頸靜脈怒張、心臟無雜音，胸部無濕囉音及腳部無水腫，其他理學檢查都正常。心電圖呈現典型前壁心肌梗塞變化。下列那項處置組合最適合此病人？① 靜脈注射 tPA ② 口服 aspirin ③ 口服 captopril ④ 口服 atenolol ⑤ 安排緊急心導管手術
A. ① ② ③
B. ② ③ ④
C. ③ ④ ⑤
D. ① ⑤

正確答案：B. ② ③ ④